Which are the main advantages of kallisto against similar methodologies?

Kallisto is two orders of magnitude faster than similar methodologies. It uses a novel efficient approach to perform this analysis and to calculate informative metrics at each depth required to inform a broad range of functional and evolutionary studies. It improves performance and speed of RNA sequencing analysis of large data sets.